Para el cuidado de las grietas del pezón durante la lactancia se recomienda:
1. Lavados con agua y jabón de pH neutro tras cada toma.
2. Extender unas gotas de leche y dejar secar al aire tras la tetada.
3. El uso de pomadas cicatrizantes.
4. Alcohol de 70º aplicado mediante gasas estériles entre tomas.
5. Aplicar frío entre las tomas.

Respuesta correcta: 2. Extender unas gotas de leche y dejar secar al aire tras la tetada.